¿Cuál es el modelo de Evaluación psicológica cuyo supuesto básico es que la conducta anormal está asociada a factores endógenos o internos, ya sean biológicos o intrapsíquicos, cuyo objeto de estudio es el síntoma, que nos va a permitir construir síndromes y posteriormente poder aplicar un tratamiento?
1. El modelo Conductual.
2. El modelo del Atributo.
3. El modelo Clínico-dinámico, perspectiva Psicoanalítica.
4. El modelo Clínico-dinámico, perspectiva Médico-Psiquiátrica.
5. El modelo Constructivista.

Respuesta correcta: 4. El modelo Clínico-dinámico, perspectiva Médico-Psiquiátrica.